Clinical trial exclusion criteria:
Concomitant use with oral anticoagulant drugs
Acquired deficiency of coagulation factors whose treatment is established
Hypersensitivity to a PCC
History of thrombocytopenia induced by heparin
Disseminated intravascular coagulation
Extracranial active bleeding
Hypersensitivity to vitamin K

Annotated entities:
- Temporal: "Concomitant"
- Drug: "oral anticoagulant drugs"
- Condition: "Acquired deficiency of coagulation factors"
- Qualifier: "whose treatment is established"
- Condition: "Hypersensitivity"
- Drug: "PCC"
- Condition: "thrombocytopenia"
- Drug: "heparin"
- Condition: "Disseminated intravascular coagulation"
- Condition: "Extracranial bleeding"
- Qualifier: "active"
- Condition: "Hypersensitivity"
- Drug: "vitamin K"